Tiene una herencia dominante ligada al cromosoma X la:
1. Distrofia muscular de Duchenne.
2. Enfermedad de Fabry.
3. Corea de Huntington.
4. Fibrosis quística.
5. Síndrome de Rett.

Respuesta correcta: 5. Síndrome de Rett.